Patient of appropriate caregiver able to give Informed Consent

The above is a clinical trial inclusion criterion. Annotated with entity spans:
[Informed_consent: Patient of appropriate caregiver able to give Informed Consent]